成年男子精液的成分含量最多來自何處？
A. 睪丸
B. 副睪
C. 儲精囊
D. 前列腺

正確答案：C. 儲精囊